Bradicinesia, rigidez y temblor de reposo son síntomas característicos de:
1. Esclerosis Lateral Amiotrófica.
2. Enfermedad de Parkinson.
3. Corea de Huntington.
4. Enfermedad de Alzheimer.

Respuesta correcta: 2. Enfermedad de Parkinson.